有關細菌的基因表現之敘述，下列何者錯誤？
A. 細菌的 protein coding gene 不含 intron
B. 細菌僅有一種 RNA polymerase 進行轉錄作用
C. 細菌的 mRNA 的轉錄可和轉譯同步發生
D. 細菌所有的 RNA，均不須進行轉錄後 processing

正確答案：D. 細菌所有的 RNA，均不須進行轉錄後 processing